Users of at least 2 cups of caffeinated coffee per day who are willing to be randomized to any of the interventions.

The above is a clinical trial inclusion criterion. Annotated with entity spans:
Users of [Multiplier: at least 2 cups] of [Drug: caffeinated coffee] per day who are [Observation: willing to be randomized] to any of the interventions.